G-6-PD deficiency

The above is a clinical trial exclusion criterion. Annotated with entity spans:
[Condition: G-6-PD deficiency]